腸胃道基質瘤（gastrointestinal stromal tumor, GIST）最常見的突變基因是：
A. KRAS
B. c-KIT
C. BRAF
D. Her2/Neu

正確答案：B. c-KIT